The formation of which inflammatory molecule is regulated by MAP3K8 (TPL2)?

IL-1β formation is regulated by MAP3K8 (TPL2)